Male and/or female patients from 30-80 years of age with a diagnosis of Type 2 diabetes (WHO criteria).

The above is a clinical trial inclusion criterion. Annotated with entity spans:
Male and/or female patients from [Value: 30-80 years] [Person: of age] with a diagnosis of [Condition: Type 2 diabetes] (WHO criteria).